Major surgical procedure, open biopsy, or significant traumatic injury within 4 weeks prior to Day 1, or anticipation of need for major surgical procedure during the course of the study

The above is a clinical trial exclusion criterion. Annotated with entity spans:
[Qualifier: Major] [Procedure: surgical procedure], [Procedure: open biopsy], or [Qualifier: significant] [Condition: traumatic injury] [Temporal: within 4 weeks prior to Day 1], or [Mood: anticipation of need] for [Qualifier: major] [Procedure: surgical procedure] [Temporal: during the course of the study]